Which are the Proprotein Convertase Subtilisin Kexin 9 (PCSK9) inhibitors that are FDA approved?

The PCSK9 inhibitors that are FDA approved are:
1) Alirocumab and 
2) Evolocumab.